Clinical trial inclusion criterion:
Absolute neutrophil count (ANC) >1,500/microL and platelets >100,000/microL (≤72 hours prior to initial treatment).

Annotated entities:
- Measurement: "Absolute neutrophil count (ANC)"
- Value: ">1,500/microL"
- Measurement: "platelets"
- Value: ">100,000/microL"
- Temporal: "≤72 hours prior to initial treatment"
- Reference_point: "initial treatment"